48 歲女性，因為自己摸到右側乳房有一個腫瘤就醫，經檢查後確定為乳癌。下列何種乳癌的狀況代 表的預後可能最好？
A. 為 4 公分大的原位癌
B. 有一顆腋下淋巴結轉移
C. 皮下淋巴管有癌細胞存在
D. HER2/neu 基因或蛋白過度表現

正確答案：A. 為 4 公分大的原位癌